Clinical trial exclusion criterion:
Participation in other clinical trials that may interfere with this study

Annotated entities:
- Non-query-able: "Participation in other clinical trials that may interfere with this study"